Which proteins remove H2A.Z in the yeast Saccharomyces cerevisiae?

we also report that the histone chaperone anp32e, which is implicated in removing h2az from chromatin, similarly promotes hr and appears to work on the same pathway as ino80 in these assays.